Clinical trial exclusion criteria:
Patients with renal impairment (serum creatinine more than twice the upper limit of normal).
Patients with heart failure.
Patients with sepsis or active infection.
Patients with diabetes mellitus (either primary or secondary to thalassemia).
regular consumption of medication with potential hepatotoxicity.
regular herbal medicine or antioxidant supplementation.
patients with gastrointestinal conditions preventing adsorption of oral medication.

Annotated entities:
- Condition: "renal impairment"
- Measurement: "serum creatinine"
- Value: "more than twice the upper limit of normal"
- Condition: "heart failure"
- Condition: "sepsis"
- Condition: "active infection"
- Condition: "diabetes mellitus"
- Qualifier: "primary"
- Qualifier: "secondary to thalassemia"
- Condition: "hepatotoxicity"
- Drug: "medication"
- Drug: "antioxidant supplementation"
- Procedure: "herbal medicine"
- Non-query-able: "patients with gastrointestinal conditions preventing adsorption of oral medication."